Clinical trial exclusion criterion:
P-glycoprotein (P-gp) inducers (e.g., rifampin, St. John's wort)

Annotated entities:
- Drug: "P-glycoprotein (P-gp) inducers"
- Drug: "rifampin"
- Drug: "St. John's wort"